49 歲男性肝硬化併發右側大量肋膜積液，已存在一個星期，插入 32Fr 胸管後，釋放出 2,200 毫升稻草色積液。幾分鐘後，病人變成呼吸困難和焦慮。則最可能的原因為何？
A. 肺動脈栓塞（pulmonary embolism）
B. 再膨脹肺水腫（re-expansion pulmonary edema）
C. 嚴重的傷口疼痛
D. 胸管插入肺部

正確答案：B. 再膨脹肺水腫（re-expansion pulmonary edema）